Clinical trial exclusion criterion:
Contraindication to prostaglandins according to current Parkland protocol

Annotated entities:
- Condition: "Contraindication"
- Drug: "prostaglandins"
- Procedure: "Parkland protocol"